Clinical trial inclusion criteria:
Currently smoke at least ten cigarettes a day
Have been smoking for at least one year
Meet criteria for schizophrenia, schizoaffective disorder, or another psychotic disorder based on structured clinical interview
Can speak and write fluent conversational English
Are between 18 and 70 years of age
Are willing to make a smoking cessation attempt
Score 26 or higher on the Montreal Cognitive Assessment

Annotated entities:
- Observation: "smoke"
- Multiplier: "at least ten cigarettes a day"
- Observation: "smoking"
- Temporal: "at least one year"
- Condition: "schizophrenia"
- Condition: "schizoaffective disorder"
- Condition: "psychotic disorder"
- Non-query-able: "Can speak and write fluent conversational English"
- Person: "age"
- Value: "between 18 and 70 years"
- Post-eligibility: "Are willing to make a smoking cessation attempt"
- Measurement: "Montreal Cognitive Assessment"
- Value: "26 or higher"